Clinical trial exclusion criterion:
Patient under legal guardianship

Annotated entities:
- Non-query-able: "Patient under legal guardianship"